Clinical trial exclusion criteria:
Allergy or hypersensitivity to bupivacaine
Pregnancy
Incarceration
Age < 18 years
Indwelling continuous thoracic epidural analgesia

Annotated entities:
- Condition: "Allergy"
- Condition: "hypersensitivity"
- Drug: "bupivacaine"
- Condition: "Pregnancy"
- Person: "Incarceration"
- Person: "Age"
- Value: "< 18 years"
- Procedure: "thoracic epidural analgesia"
- Qualifier: "continuous"
- Qualifier: "Indwelling"